下列有關地中海性貧血（thalassemia）的敘述，何者錯誤？
A. 地中海性貧血是一種體染色體隱性遺傳的疾病（autosomal recessive）
B. 最常造成α地中海性貧血的原因是單點突變（point mutation）
C. 骨髓移植是治療重型地中海性貧血（thalassemia major）方法之一
D. 國人地中海性貧血之基因帶原率（gene carrier rate）約有二十分之一

正確答案：B. 最常造成α地中海性貧血的原因是單點突變（point mutation）